Clinical trial inclusion criterion:
Pregnant women with abdomen discumfort and ultrasound diagnosis of polyhydramnios (AFI>25cm)

Annotated entities:
- Condition: "Pregnant"
- Person: "women"
- Condition: "abdomen discumfort"
- Procedure: "ultrasound"
- Condition: "polyhydramnios"
- Measurement: "AFI"
- Value: ">25cm"
- Value: "diagnosis"